32 歲女性，主訴無月經 3 個月，抽血檢驗，estradiol＜20 pg/mL，濾泡刺激素（FSH）為 80 IU/L，下列何者最為正確？
A. 因懷孕引致無月經
B. 欲懷孕需卵子捐贈
C. 可以使用 clomiphene 以刺激排卵
D. 因腦下垂體機能障礙引致無月經

正確答案：B. 欲懷孕需卵子捐贈